HBsAg-positive for more than 6 months (HBeAg-positive or HBeAg-negative).

The above is a clinical trial inclusion criterion. Annotated with entity spans:
[Measurement: HBsAg]-[Value: positive] for [Temporal: more than 6 months] ([Measurement: HBeAg]-[Value: positive] or [Measurement: HBeAg]-[Value: negative]).